Clinical trial inclusion criterion:
Subjects over the age of 18 years who agree informed consent and who have at least one polyp of eligible size (6-10mm)

Annotated entities:
- Person: "age"
- Value: "18 years over"
- Non-query-able: "agree informed consent"
- Post-eligibility: "agree informed consent"
- Multiplier: "at least one"
- Condition: "polyp"
- Qualifier: "eligible size"
- Context_Error: "eligible size"
- Value: "6-10mm"